Clinical trial exclusion criterion:
Sitting systolic BP < 100 mmHg

Annotated entities:
- Condition: "systolic BP"
- Qualifier: "Sitting"
- Value: "< 100 mmHg"